Acute bacterial endocarditis and endocarditis lenta.

The above is a clinical trial exclusion criterion. Annotated with entity spans:
[Condition: Acute bacterial endocarditis] and [Condition: endocarditis lenta].